Clinical trial exclusion criterion:
8. Patients with active systemic infections

Entity relations:
- Has_temporal("systemic infections", "active")